Patient has previously been randomized in this study

The above is a clinical trial exclusion criterion. Annotated with entity spans:
[Non-query-able: Patient has previously been randomized in this study]